Clinical trial inclusion criterion:
No known allergy to Bupivacaine.

Annotated entities:
- Condition: "allergy"
- Drug: "Bupivacaine"
- Negation: "No"